有一眼眶嚴重浮腫之病患，其病史為數天前以蛙肉塗敷眼眶周邊傷口，就診時自傷口取出 2 隻約 3 公分之白色蟲體，依據以上敘述，該病患最可能感染何種寄生蟲？
A. 廣東住血線蟲（Angiostrongylus cantonensis）
B. 豬肉絛蟲（Taenia solium）
C. 曼森裂頭絛蟲（Spirometra mansonoides）
D. 廣節裂頭絛蟲（Diphyllobothrium latum）

正確答案：C. 曼森裂頭絛蟲（Spirometra mansonoides）